Are ambulatory and able to use a toilet independently

The above is a clinical trial inclusion criterion. Annotated with entity spans:
Are [Condition: ambulatory] and [Condition: able to use a toilet independently]